Clinical trial exclusion criterion:
Have abnormal results for the following laboratory tests: serum 25(OH)D; serum creatinine; serum calcium; PTH; TSH

Annotated entities:
- Value: "abnormal results"
- Measurement: "serum 25(OH)D"
- Measurement: "serum creatinine"
- Measurement: "serum calcium"
- Measurement: "PTH"
- Measurement: "TSH"